下列那一種胺基酸是腎上腺素（epinephrine）和正腎上腺素（norepinephrine）生合成的前驅物？
A. arginine
B. histidine
C. tyrosine
D. tryptophan

正確答案：C. tyrosine